platelet count <50,000/ µL

The above is a clinical trial exclusion criterion. Annotated with entity spans:
[Measurement: platelet count] [Value: <50,000/ µL]